En la valoración de una base fuerte con un ácido fuerte el pH del punto de equivalencia:
1. Depende de la base fuerte que se valore.
2. Lo determina el exceso de OH ̄ de la disolución.
3. Depende del ácido fuerte que se utilice como valorante.
4. Lo determina la disociación del agua.
5. Lo determina el exceso de H+ de la disolución.

Respuesta correcta: 4. Lo determina la disociación del agua.